planned sequential both-sided lower third molar extraction (split-mouth) with osteotomy (with or without upper molar extraction in local anesthesia)

The above is a clinical trial inclusion criterion. Annotated with entity spans:
[Mood: planned] [Qualifier: sequential] [Qualifier: both-sided] [Procedure: lower third molar extraction] ([Qualifier: split-mouth]) with [Procedure: osteotomy] (with or without [Procedure: upper molar extraction] in [Procedure: local anesthesia])